In clinical judgement of study doctor, participant should not participate.

The above is a clinical trial exclusion criterion. Annotated with entity spans:
[Non-query-able: In clinical judgement of study doctor, participant should not participate].